Allergy to local anaesthesia

The above is a clinical trial exclusion criterion. Annotated with entity spans:
[Condition: Allergy] to [Drug: local anaesthesia]